下列有關異位性皮膚炎的敘述，何者錯誤？
A. 常發生於老年人
B. 病人常同時患有氣喘（asthma）或過敏性鼻炎（allergic rhinitis）
C. 實驗室檢查常可見血液中 IgE 上升
D. 可伴隨 herpes simplex 感染，稱 eczema herpeticum

正確答案：A. 常發生於老年人